Clinical trial exclusion criterion:
patient already treated by medicines which could interfere with the study

Annotated entities:
- Context_Error: "patient already treated by medicines which could interfere with the study"